Clinical trial exclusion criterion:
a history of use of alpha 2 receptor agonists or antagonists.

Entity relations:
- Has_temporal("alpha 2 receptor agonists", "history")
- OR("alpha 2 receptor agonists", "alpha 2 receptor antagonists")